A person who is or is a beneficiary of social security

The above is a clinical trial inclusion criterion. Annotated with entity spans:
[Non-query-able: A person who is or is a beneficiary of social security]